Clinical trial inclusion criterion:
Men and women older than 18 years, scheduled consecutively to perform a coronary procedure in the department of hemodynamics of the National Institute of Cardiology "Ignacio Chavez".

Annotated entities:
- Person: "Men"
- Person: "women"
- Person: "years"
- Value: "older than 18"
- Mood: "scheduled"
- Procedure: "coronary procedure"
- Visit: "the National Institute of Cardiology "Ignacio Chavez""
- Visit: "department of hemodynamics"